21歲陳先生，無過去病史。3天前開始發燒、咳嗽。今天就診時仍發燒，且呼吸較急促、呼吸時胸痛，意識清楚。血壓96/62 mmHg，脈搏102 bpm，呼吸24 bpm，耳溫39.2℃，右下肺葉扣診濁音（dullness），胸部X光出現右下肺葉浸潤，診斷為肺炎。依據CURB-65的原則，是否需要住院？
A. 不需住院，可門診治療
B. 需住院治療，但只需入住一般病房
C. 需住院治療，且需入住加護病房
D. 未抽血檢查，無法判定

正確答案：A. 不需住院，可門診治療